外科加護病房的術後病人，第二天早上嘗試脫離呼吸機（weaning），下列指標數值，何者最不適合考慮拔管？
A. 潮氣容積（tidal volume）＞5 mL/kg，肺活量（vital capacity）＞10 mL/kg
B. 淺快呼吸指標（rapid shallow breathing index）＞105
C. 最大吸氣壓力（maximal inspiratory pressure）＜-25 cmH2O
D. 給與FiO2 40～50%且吐氣末正壓（positive end expiratory pressure）＜5 cmH2O時，測得動脈血氧飽和度（SaO2）＞90%

正確答案：B. 淺快呼吸指標（rapid shallow breathing index）＞105